Clinical trial exclusion criterion:
A moderate/severe COPD exacerbation that has not resolved at least 14 days prior to Visit 1 and at least 30 days following the last dose of oral corticosteroids (if applicable).

Entity relations:
- Has_negation("resolved", "not")
- Has_temporal("resolved", "at least 14 days prior to Visit 1")
- Has_context("COPD exacerbation", "resolved")
- Has_qualifier("COPD exacerbation", "moderate")
- Has_index("at least 30 days following the last dose of oral corticosteroids", "the last dose of oral corticosteroids")
- Has_temporal("resolved", "at least 30 days following the last dose of oral corticosteroids")
- OR("moderate", "severe")